INR known to be greater than 1.5 at the time of screening

The above is a clinical trial inclusion criterion. Annotated with entity spans:
[Measurement: INR] known to be [Value: greater than 1.5] [Temporal: at the time of screening]